Clinical trial inclusion criterion:
Confirmed diagnosis (clinical and histological features) of Hailey Hailey or Darier diseases.

Entity relations:
- AND("Hailey Hailey disease", "histological")
- OR("Hailey Hailey disease", "Darier disease")